Clinical trial exclusion criterion:
3. Use of hormonal contraceptives and hormonal replacement therapy within three months prior to the initial dose of study medication.

Annotated entities:
- Parsing_Error: "3."
- Drug: "hormonal contraceptives"
- Drug: "hormonal replacement therapy"
- Temporal: "within three months prior"
- Reference_point: "the initial dose of study medication"